List inflammatory caspase proteins?

caspase-1
caspase-4
caspase-5